Clinical trial inclusion criterion:
Normal and healthy (immune competent) as determined by medical history, physical exam, vital signs and clinical laboratory tests during the screening period.

Entity relations:
- Has_index("during the screening period", "screening period")
- Has_qualifier("medical history", "healthy")
- Has_qualifier("medical history", "Normal")
- Has_temporal("medical history", "during the screening period")
- Has_qualifier("physical exam", "healthy")
- Has_qualifier("vital signs", "healthy")
- Has_qualifier("clinical laboratory tests", "healthy")
- Has_qualifier("physical exam", "Normal")
- Has_qualifier("vital signs", "Normal")
- Has_qualifier("clinical laboratory tests", "Normal")
- Has_temporal("physical exam", "during the screening period")
- Has_temporal("vital signs", "during the screening period")
- Has_temporal("clinical laboratory tests", "during the screening period")